Contraindication to spinal anesthesia

The above is a clinical trial exclusion criterion. Annotated with entity spans:
[Condition: Contraindication] to [Procedure: spinal anesthesia]